high blood pressure (>160/100mmHg)

The above is a clinical trial exclusion criterion. Annotated with entity spans:
[Condition: high blood pressure] ([Value: >160/100mmHg])